Clinical trial inclusion criterion:
Subject has any mental or neuromuscular disorder which would create an unacceptable risk of fixation failure or complications in postoperative care.

Entity relations:
- Has_mood("fixation failure", "risk of")
- Has_qualifier("fixation failure", "unacceptable")
- AND("mental disorder", "fixation failure")
- OR("mental disorder", "neuromuscular disorder")
- OR("fixation failure", "complications")